Clinical trial exclusion criterion:
Type 1 diabetes mellitus,presence of autoimmune diabetes indicated by antibodies to insulin, islet cells, and GAD;

Entity relations:
- Has_qualifier("antibodies", "insulin")
- AND("autoimmune diabetes", "antibodies")
- OR("insulin", "islet cells", "GAD")